What is BEL(Biological Expression Language) used for?

Biological Expression Language (BEL) is a novel method for the statistical extraction of causal relation relationships from large biomedical literature datasets.